有關ADP-核糖基化（ADP-ribosylation）的修飾以調節其訊息傳遞的敘述，下列何者正確？
A. Gs的甲型次單元（α subunit），受霍亂毒素（cholera toxin）的修飾
B. Gs上甲型次單元（α subunit），受pertussin toxin的修飾
C. 細胞膜受體，受pertussin toxin的修飾
D. 磷脂酶（phospholipase）受霍亂毒素（cholera toxin）的修飾

正確答案：A. Gs的甲型次單元（α subunit），受霍亂毒素（cholera toxin）的修飾